10. Ability to comply with study procedures for the entire length of the study

The above is a clinical trial inclusion criterion. Annotated with entity spans:
10. [Non-query-able: Ability to comply with study procedures for the entire length of the study]